Inflammatory condition e.g. Connective tissue disorder, Rheumatoid arthritis

The above is a clinical trial exclusion criterion. Annotated with entity spans:
[Condition: Inflammatory] condition e.g. [Condition: Connective tissue disorder,] [Condition: Rheumatoid arthritis]